End stage renal disease or on dialysis

The above is a clinical trial exclusion criterion. Annotated with entity spans:
[Condition: End stage renal disease] or on [Procedure: dialysis]